60歲男性因喉嚨疼痛與潰瘍在就醫時被發現血中白血球增加（50×103/µL；參考區間為4.8-10.8×103/µL），紅血球、血小板數目減少。骨髓切片顯示骨髓中細胞佔70-80%，大部分都是中等大小原始細胞（blast cells），細胞質中有非常多火紅顆粒及針狀小體。染色體檢查發現有t（15;17）的染色體轉位。下列何者為最可能的診斷？
A. 骨髓化生不良症候群（myelodysplastic syndrome）
B. 蘭格罕組織球增生症（Langerhans cell histiocytosis）
C. 慢性骨髓性白血病（chronic myeloid leukemia）
D. 急性骨髓性白血病（acute myeloid leukemia）

正確答案：D. 急性骨髓性白血病（acute myeloid leukemia）